Clinical trial exclusion criterion:
daily chronic opioid use (over 3 months of continuous opioid use)

Entity relations:
- Has_qualifier("opioid", "chronic")
- Has_temporal("opioid", "over 3 months")